El ciclo de la urea:
1. Supone la degradación de la urea.
2. Fue propuesto por Hatch y Slack.
3. Contiene una reacción que transforma la citrulina en ornitina.
4. Está íntimamente ligado a la glucolisis.
5. Comienza con la formación de carbamilfosfato.

Respuesta correcta: 5. Comienza con la formación de carbamilfosfato.